psychic disorder (not including mild depression)

The above is a clinical trial exclusion criterion. Annotated with entity spans:
[Condition: psychic disorder] ([Negation: not] including [Condition: mild depression])